Liver enzymes equal or more than 1.5 times the upper limit of normal

The above is a clinical trial exclusion criterion. Annotated with entity spans:
[Measurement: Liver enzymes] [Value: equal or more than 1.5 times the upper limit of normal]